尿路動力學檢查中，那一項目最可測出前列腺肥大所造成的膀胱出口阻塞？
A. 尿流速測定（uroflowmetry）
B. 膀胱壓力圖（cystometry）
C. 壓力尿流速檢查（pressure-flow study）
D. 尿道壓力圖（urethral pressure profile）

正確答案：C. 壓力尿流速檢查（pressure-flow study）